在器官移植時，腎上腺皮質素也是經常使用的抗排斥藥物之一，下列何者是最常使用的腎上腺皮質素？
A. Beclomethasone
B. Prednisolone
C. Dexamethasone
D. Triamcinolone

正確答案：B. Prednisolone